下列何者直接連結膀胱的頂端（apex）？
A. 懸韌帶
B. 臍外韌帶
C. 臍內韌帶
D. 臍正中韌帶

正確答案：D. 臍正中韌帶